The secreted frizzled-related protein 3 (sFPR3) is altered in human cancers.
Are its level found to increase or to decrease?

Secreted frizzled-related protein 3 is potentially acting as a tumor suppressor gene, thus it is down-regulated (decreased) in some cancers.